先天性囊狀腺瘤樣異常（Congenital cystic adenomatoid malformation）依囊腫大小可分為三種，下列何項說法最正確？
A. Type I 預後較差
B. Type II 預後較差
C. Type III 預後較差
D. 預後與種類無關

正確答案：C. Type III 預後較差